Clinical trial exclusion criterion:
Pregnancy complicated with pre-eclampsia

Annotated entities:
- Condition: "Pregnancy"
- Condition: "pre-eclampsia"